Clinical trial inclusion criterion:
Men and women 18 years and older;

Annotated entities:
- Person: "Men"
- Person: "women"
- Value: "18 years and older"
- Person: "years"